creatinine > 2,5 mg/dl

The above is a clinical trial exclusion criterion. Annotated with entity spans:
[Measurement: creatinine] [Value: > 2,5 mg/dl]